Clinical trial inclusion criterion:
TBIL(total bilirubin ), ALT(alanine aminotransferase),AST(glutamic-oxalacetic transaminase) > 2.5×ULN(upper limit of normal); if it were caused by liver metastases, TBIL, ALT,AST >5×ULN.

Annotated entities:
- Measurement: "total bilirubin"
- Measurement: "TBIL"
- Measurement: "ALT"
- Measurement: "alanine aminotransferase"
- Measurement: "AST"
- Measurement: "glutamic-oxalacetic transaminase"
- Value: "> 2.5×ULN"
- Condition: "liver metastases"
- Measurement: "TBIL"
- Measurement: "ALT"
- Measurement: "AST"
- Value: ">5×ULN"